Según el Código Deontológico, en su ejercicio profesional, la enfermera/o garantizará y llevará a cabo un tratamiento correcto y adecuado a todas las personas que lo necesiten:
1. Menos en los supuestos de riesgos.
2. Independientemente de cual sea su padecimiento, edad o circunstancia.
3. Salvo cuando se trate de enfermos jurídicamente declarados peligrosos.
4. Pero puede eximirse de su obligación sólo cuando se trate de enfermos infectocontagiosos.
5. Excepto cuando el profesional presente por escrito su objeción.

Respuesta correcta: 2. Independientemente de cual sea su padecimiento, edad o circunstancia.